Clinical trial exclusion criteria:
none, all patients meeting the inclusion criteria will be eligible.

Annotated entities:
- Non-representable: "none, all patients meeting the inclusion criteria will be eligible."